周細胞（pericytes）主要位於何種血管壁？
A. 連續性微血管（continuous capillaries）
B. 中型靜脈（medium veins）
C. 肌型動脈（muscular arteries）
D. 小動脈（arterioles）

正確答案：A. 連續性微血管（continuous capillaries）